Ocular surgical procedures 3 months before the protocol inclusion

The above is a clinical trial exclusion criterion. Annotated with entity spans:
[Procedure: Ocular surgical procedures] [Temporal: 3 months before the protocol inclusion]